Clinical trial exclusion criterion:
10. History of DVT or pulmonary embolism within 6 months;

Annotated entities:
- Parsing_Error: "10."
- Condition: "DVT"
- Condition: "pulmonary embolism"
- Temporal: "within 6 months"
- Temporal: "History"